Clinical trial exclusion criterion:
With contraindication to receive adjuvant chemotherapy.

Entity relations:
- AND("contraindication", "adjuvant chemotherapy")